4. Subjects with history or evidence upon physical examination of CNS disease, including primary brain tumor, seizures not controlled with standard medical therapy, any brain metastases, or, within six months prior to Day 1 of this study, history of cerebrovascular accident (CVA, stroke), transient ischemic attack (TIA) or subarachnoid hemorrhage.

The above is a clinical trial exclusion criterion. Annotated with entity spans:
[Parsing_Error: 4.] Subjects with history or evidence upon physical examination of [Condition: CNS disease], including [Condition: primary brain tumor], [Condition: seizures] [Negation: not] [Qualifier: controlled] with [Drug: standard medical therapy], any [Condition: brain metastases], or, [Temporal: within six months prior to Day 1 of this study], history of [Condition: cerebrovascular accident] ([Condition: CVA], [Condition: stroke]), [Condition: transient ischemic attack (TIA)] or [Condition: subarachnoid hemorrhage].